Clinical trial exclusion criterion:
Previous history of intolerance to recommended target doses of ACEIs or ARBs.

Entity relations:
- Has_temporal("intolerance", "history")
- Has_temporal("intolerance", "Previous")
- AND("intolerance", "ACEIs")
- OR("ACEIs", "ARBs")